Clinical trial inclusion criterion:
Concomitant use of simvastatin/lovastatin > 40 mg qd

Entity relations:
- Has_temporal("simvastatin", "Concomitant")
- Has_temporal("lovastatin", "Concomitant")
- Has_multiplier("lovastatin", "> 40 mg qd")
- Has_multiplier("simvastatin", "> 40 mg qd")
- OR("simvastatin", "lovastatin")